3. Hepatic insufficiency defined as total bilirubin > 2 mg/dL or serum albumin < 25 g/L

The above is a clinical trial exclusion criterion. Annotated with entity spans:
[Parsing_Error: 3.] [Condition: Hepatic insufficiency] defined as [Measurement: total bilirubin] [Value: > 2 mg/dL] or [Measurement: serum albumin] [Value: < 25 g/L]